New or presumed new significant ST-T wave changes

The above is a clinical trial inclusion criterion. Annotated with entity spans:
[Multiplier: New] or [Multiplier: presumed new] [Qualifier: significant] [Condition: ST-T wave changes]